3. documented allergy to any local or general anesthetic medications

The above is a clinical trial exclusion criterion. Annotated with entity spans:
[Undefined_semantics: 3. documented allergy to any local or general anesthetic medications]